Clinical trial inclusion criteria:
South Australian secondary school students in years 10, 11, and 12 in 2017
Written parental consent for those under the age of 18
Written student consent assent for those under the age of 18 (or if 18 years old and older consent for themselves)
Available at school for at least the first pharyngeal swab and willing to comply with study procedures

Annotated entities:
- Observation: "secondary school students"
- Qualifier: "years 10"
- Qualifier: "years 11"
- Qualifier: "years 12"
- Temporal: "in 2017"
- Visit: "South Australian"
- Informed_consent: "Written parental consent for those under the age of 18"
- Informed_consent: "Written student consent assent for those under the age of 18 (or if 18 years old and older consent for themselves)"
- Multiplier: "first"
- Procedure: "pharyngeal swab"
- Mood: "willing to"
- Observation: "comply with study procedures"